Clinical trial inclusion criterion:
have undergone oro-tracheal intubation for a coma (Glasgow Coma Score below or equal to 8),

Annotated entities:
- Procedure: "oro-tracheal intubation"
- Condition: "coma"
- Measurement: "Glasgow Coma Score"
- Value: "below or equal to 8)"